下肺葉病灶刺激貼著縱隔及橫膈中央的壁層胸膜而引起頸部疼痛，最有可能是下列那一條神經所引發之痛？
A. 肋間神經
B. 迷走神經
C. 膈神經
D. 交感神經幹

正確答案：C. 膈神經